osteoarticular, neuromuscular or cognitive limitation that prevents ambulation

The above is a clinical trial exclusion criterion. Annotated with entity spans:
[Observation: osteoarticular], [Observation: neuromuscular] or [Observation: cognitive limitation] that [Negation: prevents] [Observation: ambulation]